Clinical trial exclusion criterion:
neurologic condition causing the loss of function of the finger to be treated

Annotated entities:
- Condition: "neurologic condition"
- Condition: "loss of function"
- Qualifier: "finger to be treated"